What is STATegra?

It's a multi-omics dataset that combines measurements from up to 10 different omics technologies, namely pre-B-cell differentiation.